Subjects undergoing elective total knee or hip replacement or a revision of at least one component of a total knee or hip replacement

The above is a clinical trial inclusion criterion. Annotated with entity spans:
Subjects [Temporal: undergoing] [Qualifier: elective] [Procedure: total knee] or hip replacement or a revision of [Qualifier: at least one component] of [Procedure: a total knee] or hip replacement